2. Any finding of the medical examination (including blood pressure, pulse rate and electrocardiogram) deviating from normal and of clinical relevance

The above is a clinical trial exclusion criterion. Annotated with entity spans:
[Parsing_Error: 2.] [Subjective_judgement: Any finding of the medical examination (including blood pressure, pulse rate and electrocardiogram) deviating from normal and of clinical relevance]